下列何者最可能緊貼在排空後的膀胱上方？
A. 直腸
B. 子宮
C. 陰道
D. 輸卵管

正確答案：B. 子宮